La Reactividad es considerada como una fuente de error al utilizar la Observación como método de obtención de información ¿de dónde procede?
1. Del contexto en el que se genera la Observación.
2. Del sujeto observado.
3. Del procedimiento elegido.
4. Del observador.
5. Del tipo de instrumento elegido.

Respuesta correcta: 2. Del sujeto observado.